Diagnosis of sickle cell disease

The above is a clinical trial inclusion criterion. Annotated with entity spans:
[Mood: Diagnosis] of [Condition: sickle cell disease]